Clinical trial exclusion criterion:
Patients in whom TIMI-3 flow was not able to be established after wire crossing, balloon angioplasty or thrombectomy.

Annotated entities:
- Non-representable: "Patients in whom TIMI-3 flow was not able to be established after wire crossing, balloon angioplasty or thrombectomy."